Clinical trial inclusion criteria:
Physically healthy adults age 18-55 who meet DSM-5 criteria for insomnia and Criterion A (exposure to a traumatic event) for PTSD. The index trauma must have occurred within the past 5 years and at least 3 months before enrolling, and insomnia symptoms must have started or worsened after the exposure to the index trauma

Annotated entities:
- Qualifier: "healthy"
- Person: "adults"
- Person: "age"
- Value: "18-55"
- Condition: "insomnia"
- Qualifier: "DSM-5"
- Condition: "PTSD"
- Qualifier: "Criterion A"
- Condition: "trauma"
- Qualifier: "index"
- Temporal: "the past 5 years and at least 3 months"
- Non-query-able: "and insomnia symptoms must have started or worsened after the exposure to the index trauma"